有關棘狀阿米巴角膜炎（Acanthamoeba keratitis）的敘述，何者錯誤？
A. 較好發於隱形眼鏡清潔習慣不良的配戴者
B. 病程初期可形成偽樹枝狀（pseudodendrite）的病灶，容易與疱疹性角膜炎混淆
C. 病程後期角膜可出現環狀浸潤（ring infiltration）
D. 對大多數抗生素有效

正確答案：D. 對大多數抗生素有效